Having significant medical illnesses that would interfere with the conduct of the study

The above is a clinical trial exclusion criterion. Annotated with entity spans:
[Non-query-able: Having significant medical illnesses that would interfere with the conduct of the study]